El sistema de normas y sanciones que se establece de modo obligatorio para los profesionales en función de las conductas de ética profesional, recibe el nombre de:
1. Bioética profesional.
2. Ética práctica.
3. Deontología profesional.
4. Derechos profesionales.
5. Código moral jerarquizado.

Respuesta correcta: 3. Deontología profesional.